Para normalizar una disolución de HCI se utiliza como patrón primario:
1. Carbonato sódico.
2. Nitrato sódico.
3. Ftalato ácido de potasio.
4. Ácido benzoico.

Respuesta correcta: 1. Carbonato sódico.